Which protein is the main marker of Cajal bodies?

Coilin is widely known as the protein marker of the Cajal body, a subnuclear domain important to the biogenesis of small nuclear ribonucleoproteins and telomerase, complexes that are crucial to pre-messenger RNA splicing and telomere maintenance, respectively. The Cajal (coiled) body is a discrete nuclear organelle that was first described in mammalian neurons in 1903.